氰化物（cyanide）常被用於自殺或謀殺。請問氰化物毒害細胞的機轉為抑制細胞的那一種物質之功能？
A. 白蛋白（albumin）
B. 細胞色素 C（cytochrome c）
C. 乳酸脫氫酶（lactate dehydrogenase）
D. 鐵結合蛋白（ferritin）

正確答案：B. 細胞色素 C（cytochrome c）